Clinical trial inclusion criterion:
7. Subject is willing and able to undergo percutaneous intervention at SOS hospital, if randomized to SOS study arm.

Entity relations:
- Has_context("percutaneous intervention", "able")
- Has_context("percutaneous intervention", "willing")
- AND("percutaneous intervention", "SOS hospital")